一分子 acetyl CoA 氧化生成二氧化碳和水共產生多少分子的 ATP（包括 GTP 在內）？［假設一對電 子進入呼吸鏈在 NADH-Q reductase（Complex I），cytochrome reductase（Complex III），cytochrome oxidase（Complex IV）分別可產生 1、0.5、1 個 ATP］
A. 8
B. 9
C. 10
D. 12

正確答案：C. 10